Clinical trial exclusion criterion:
Untreated thyroid disease

Entity relations:
- Has_qualifier("thyroid disease", "Untreated")